吞嚥過程並不包含下列何者？
A. 口腔期（oral phase）
B. 咽期（pharyngeal phase）
C. 喉期（laryngeal phase）
D. 食道期（esophageal phase）

正確答案：C. 喉期（laryngeal phase）